Be judged not suitable to participate the study by the investigators

The above is a clinical trial exclusion criterion. Annotated with entity spans:
[Post-eligibility: Be judged not suitable to participate the study by the investigators]